Clinical trial exclusion criterion:
patients with haemodynamic instability of septic origin or a respiratory insufficiency (defined by a ratio Pa02/Fi02 = 200 mmHg and PEP = 5 cmH2O)

Annotated entities:
- Condition: "septic"
- Condition: "haemodynamic instability"
- Condition: "espiratory insufficiency"
- Measurement: "Pa02/Fi02"
- Value: "= 200 mmHg"
- Measurement: "PEP"
- Value: "= 5 cmH2O"